Clinical trial inclusion criterion:
Direct bilirubin < 2.0 x ULN

Annotated entities:
- Measurement: "Direct bilirubin"
- Value: "< 2.0 x ULN"